3. Histologically confirmed squamous cell bronchogenic carcinoma. Patients whose tumors contain mixed non-small cell histologies are eligible, as long as squamous carcinoma is the predominant histology. Mixed tumors with small cell anaplastic elements are not eligible. Cytologic specimens obtained by brushings, washings, or needle aspiration of the defined lesion are acceptable.

The above is a clinical trial inclusion criterion. Annotated with entity spans:
3. [Procedure: Histologically] [Value: confirmed] [Condition: squamous cell bronchogenic carcinoma]. Patients whose tumors contain [Condition: mixed non-small cell histologies] are eligible, as long as [Condition: squamous carcinoma] is the [Qualifier: predominant histology]. [Condition: Mixed tumors] with [Observation: small cell anaplastic elements] are [Negation: not] eligible. Cytologic specimens obtained by brushings, washings, or needle aspiration of the defined lesion are acceptable.